下列那一項為計算純水清除率（free-water clearance, CH2O）的公式（V = urine flow rate; Cosm = osmolar clearance）？
A. CH2O = V + Cosm
B. CH2O = V－Cosm
C. CH2O = V．Cosm
D. CH2O = V / Cosm

正確答案：B. CH2O = V－Cosm